¿Cuántas secuencias palindrómicas existen en el cromosoma Y humano que permiten la recombinación Y-Y?:
1. 8.
2. 6.
3. 4.
4. 10.
5. 12.

Respuesta correcta: 1. 8.